於平靜呼吸狀況下，有關肋膜內壓（intrapleural pressure）之敘述，何者錯誤？
A. 吸氣與呼氣時皆為負壓
B. 低於肺泡壓（alveolar pressure）
C. 吸氣較呼氣時為低
D. 呼氣結束時之壓力為零

正確答案：D. 呼氣結束時之壓力為零